Clinical trial exclusion criterion:
Subject has a life expectancy of less than three (3) years.

Annotated entities:
- Observation: "life expectancy"
- Value: "less than three (3) years"